Forman parte integral de la barrera hematoencefálica los pies de los:
1. Astrocitos
2. Timocitos.
3. Podocitos.
4. Células ependimarias.
5. Oligodendrocitos.

Respuesta correcta: 1. Astrocitos